Clinical trial exclusion criterion:
Generalized pain or fibromyalgia;

Annotated entities:
- Condition: "Generalized pain"
- Condition: "fibromyalgia"